Men or women aged 18-60 years.

The above is a clinical trial inclusion criterion. Annotated with entity spans:
[Condition: Men or women aged 18-60 years.]